一位 28 歲婦女連續經歷二次懷孕初期（＜12 weeks）之胚胎死亡，血液染色體檢查發現她本人帶有第十三及十四號染色體之間的羅勃森氏轉位（Robertsonian translocation），核型為 45,XX,der(13;14)  週，下列何種處理方式最適當？
A. 建議終止懷孕
B. 告知胎兒染色體異常機會較高，應接受羊膜腔穿刺檢查
C. 建議接受詳細超音波檢查，若超音波檢查有問題，再接受羊膜腔穿刺檢查
D. 建議接受母血篩檢，以決定是否進一步接受羊膜腔穿刺檢查

正確答案：B. 告知胎兒染色體異常機會較高，應接受羊膜腔穿刺檢查